age 18 years or more

The above is a clinical trial inclusion criterion. Annotated with entity spans:
[Person: age] [Value: 18 years or more]